Clinical trial exclusion criteria:
Hypersensitivity to the active substance, to FCM or any of its excipients
Known serious hypersensitivity to other parenteral iron products
Anaemia not attributed to iron deficiency, e.g. other microcytic anaemia
Evidence of iron overload or disturbances in the utilisation of iron

Annotated entities:
- Condition: "Hypersensitivity"
- Drug: "active substance"
- Drug: "FCM"
- Drug: "excipients"
- Condition: "hypersensitivity"
- Drug: "parenteral iron products"
- Qualifier: "serious"
- Condition: "Anaemia"
- Negation: "not"
- Drug: "iron deficiency"
- Mood: "attributed to"
- Qualifier: "other"
- Condition: "microcytic anaemia"
- Condition: "iron overload"
- Condition: "disturbances in the utilisation of iron"
- Drug: "iron"
- Drug: "iron"